Clinical trial exclusion criterion:
2. Patient has a diagnosis of bowel obstruction, bowel strangulation, peritonitis, bowel perforation, local or systemic infection, ischemic bowel, carcinomatosis or extensively spread inflammatory bowel disease.

Annotated entities:
- Condition: "bowel obstruction"
- Condition: "bowel strangulation"
- Condition: "peritonitis"
- Condition: "bowel perforation"
- Condition: "systemic infection"
- Condition: "local infection"
- Condition: "ischemic bowel"
- Condition: "carcinomatosis"
- Condition: "inflammatory bowel disease"
- Qualifier: "extensively spread"